Persistent dyspnea on daily life (Baseline Dyspnea Index focal score <or= 8).

The above is a clinical trial inclusion criterion. Annotated with entity spans:
[Temporal: Persistent] [Condition: dyspnea on daily life] ([Temporal: Baseline] [Measurement: Dyspnea Index focal score] [Value: <or= 8]).